Clinical trial exclusion criterion:
Currently taking medications containing alcohol, metronidazole, isoniazid, paraldehyde, phenytoin, warfarin, or theophylline.

Annotated entities:
- Drug: "alcohol"
- Drug: "metronidazole"
- Drug: "isoniazid"
- Drug: "paraldehyde"
- Drug: "phenytoin"
- Drug: "warfarin"
- Drug: "theophylline"
- Temporal: "Currently"